Clinical trial exclusion criterion:
Chronic respiratory diseases;

Annotated entities:
- Condition: "Chronic respiratory diseases"